有關病毒（viruses）複製的敘述，下列何者錯誤？
A. 具外	膜（envelope）的病毒一般對環境的抗性較低
B. RNA病毒之複製大部分是在細胞質中進行
C. RNA病毒之複製大部分不需要宿主細胞的酵素
D. 具有外	膜的病毒主要藉由細胞溶解（lysis）而釋出細胞外

正確答案：D. 具有外	膜的病毒主要藉由細胞溶解（lysis）而釋出細胞外